Clinical trial inclusion criterion:
Has a HCC diagnosis confirmed by radiology, histology, or cytology (fibrolamellar, and mixed hepatocellular/cholangiocarcinoma subtypes are not eligible)

Annotated entities:
- Condition: "HCC"
- Procedure: "radiology"
- Procedure: "histology"
- Procedure: "cytology"
- Condition: "subtype fibrolamellar"
- Condition: "mixed hepatocellular/cholangiocarcinoma subtype"
- Negation: "not eligible"